Clinical trial exclusion criterion:
Current or past history of psychosis

Entity relations:
- Has_temporal("psychosis", "history")
- Has_temporal("psychosis", "Current")
- OR("Current", "past")